Clinical trial exclusion criterion:
Evidence of clinically significant cardiac abnormalities, uncontrolled hypotension, left ventricular ejection fraction below the lower limit of normal for the site or experience of significant cardiac interventional procedures

Annotated entities:
- Qualifier: "clinically significant"
- Undefined_semantics: "clinically significant"
- Condition: "cardiac abnormalities"
- Condition: "uncontrolled hypotension"
- Measurement: "left ventricular ejection fraction"
- Value: "below the lower limit of normal"
- Procedure: "cardiac interventional procedures"
- Qualifier: "significant"
- Subjective_judgement: "significant"